一位7歲小孩，媽媽注意到他最近1個月有跛腳現象（limping），而且不太走路，理學檢查發現他的右髖關節（hip）在外旋（external rotation）時活動受限，醫師懷疑他罹患Legg-Calvé-Perthes disease，下列何項檢查對此病的早期診斷最有助益？
A. computed tomography scan（CT scan）
B. magnetic resonance imaging（MRI）
C. plain radiography
D. technetium-99 methylene diphosphate bone scan

正確答案：B. magnetic resonance imaging（MRI）